El epitelio del uréter es:
1. Cilíndrico estratificado.
2. Plano estratificado.
3. Cúbico estratificado.
4. De transición.

Respuesta correcta: 4. De transición.